El primer paso en el plegamiento de cadenas polipetídicas desordenadas es:
1. Formación de la estructura primaria.
2. Formación de puentes disulfuro.
3. Formación de agregados.
4. Modificaciones postraduccionales.
5. Formación de elementos de estructura secundaria.

Respuesta correcta: 5. Formación de elementos de estructura secundaria.